關於部分厚度之傷口（Partial thickness wounds）的癒合，下列敘述何者錯誤？
A. 癒合主要是靠上皮再生
B. 有許多膠原蛋白
C. 在真皮附屬物（如毛囊及皮脂腺）的上皮細胞複製而覆蓋裸露的真皮
D. 有傷口收縮

正確答案：B. 有許多膠原蛋白